Agrees to wear a head mounted display (HMD) for up to 45 minutes

The above is a clinical trial inclusion criterion. Annotated with entity spans:
[Observation: Agrees to wear] a [Device: head mounted display (HMD)] [Temporal: for up to 45 minutes]